二尖瓣（僧帽瓣）閉鎖不全與主動脈瓣膜狹窄的心雜音，一般而言不能由下列那一項特徵來區分？
A. 一為收縮期雜音，另一為舒張期雜音
B. 雜音的特徵及期間，一為全收縮期，較 soft；另一為漸強漸弱型收縮期雜音，較 harsh
C. 雜音 radiation 不同，一至左腋下，另一至頸動脈
D. 心雜音最大強度，一在心尖部位，另一在右第二肋間（心底部位）

正確答案：A. 一為收縮期雜音，另一為舒張期雜音